Clinical trial exclusion criterion:
History of infection or intraarticular fracture of the affective hip

Entity relations:
- Has_qualifier("infection", "affective hip")
- Has_temporal("infection", "History")
- OR("infection", "intraarticular fracture")